關於不穩定型心絞痛之特性，下列敘述何者錯誤？
A. 在休息時或輕微運動時發作，或發作之嚴重程度加劇，或新發作
B. 心電圖顯示 ST 節段下降、短暫 ST 節段上升與/或 T 波倒置
C. 發作時合併有顯著心肌酵素升高
D. 動脈硬化斑塊破裂或動脈硬化斑塊病灶處有血栓併存，為最常見之病理機轉

正確答案：C. 發作時合併有顯著心肌酵素升高